Clinical trial inclusion criterion:
Score greater than 8 on Children's Yale-Brown Obsessive Compulsive Scale

Annotated entities:
- Measurement: "Children's Yale-Brown Obsessive Compulsive Scale"
- Value: "greater than 8"